aged between 3 - 36 months

The above is a clinical trial inclusion criterion. Annotated with entity spans:
[Person: aged] [Value: between 3 - 36 months]